BCVA over 77 letters between screening and Day 0

The above is a clinical trial exclusion criterion. Annotated with entity spans:
[Measurement: BCVA] [Value: over 77 letters] between screening and Day 0